Patients with symptomatic FAI

The above is a clinical trial inclusion criterion. Annotated with entity spans:
Patients with [Qualifier: symptomatic] [Condition: FAI]